La absorción intestinal de los hidratos de carbono por las células absortivas:
1. Se puede llevar a cabo con monosacáridos y disacáridos.
2. La sacarosa es transportada por la sacarasa.
3. La glucosa se transporta mediante difusión facilitada y por transporte facilitado dependiente de Na+.
4. Los transportadores facilitados de glucosa, que no unen Na+, se encuentran en el lado luminal de la célula absortiva.
5. Glucosa y fructosa se absorben por transportadores diferentes del de glucosa.

Respuesta correcta: 3. La glucosa se transporta mediante difusión facilitada y por transporte facilitado dependiente de Na+.